ALL as secondary malignancy

The above is a clinical trial exclusion criterion. Annotated with entity spans:
[Condition: ALL] as [Qualifier: secondary] [Condition: malignancy]